La validación de un método analítico incluye:
1. Validar el proceso analítico en su conjunto, validar el intervalo de concentraciones en que se aplica y validar el método en cada una de las matrices a las que se aplicará.
2. Sólo incluye validar el intervalo de concentraciones en que se aplica.
3. Sólo incluye validar el método en cada una de las matrices a las que se aplicará.
4. Sólo es necesario validar las etapas de tratamiento de las muestras previas a la medida analítica.
5. Solamente se precisa validar la instrumentación mediante calibraciones adecuadas.

Respuesta correcta: 1. Validar el proceso analítico en su conjunto, validar el intervalo de concentraciones en que se aplica y validar el método en cada una de las matrices a las que se aplicará.